La cromatografía de gases combinada con la espectrometría se masas (GC-MS) es la técnica cromatrográfica acoplada más empleada. La principal dificultad del acoplamiento está en:
1. El análisis de iones moleculares en el mismo sitio en el que son generados.
2. La producción de iones muy fragmentados con generación de electrones acelerados.
3. El aumento de la velocidad de flujo de salida del cromatógrafo, que no puede superar los nL/min.
4. La obtención del espectro bidimensional que permita la separación en función de la relación q/r.
5. La introducción en el alto vacío del analizador de masas, de un compuesto que se encuentra a presión atomosférica.

Respuesta correcta: 5. La introducción en el alto vacío del analizador de masas, de un compuesto que se encuentra a presión atomosférica.